Las secuencias de localización nuclear (NLS):
1. Se eliminan tras el transporte nuclear de la proteína.
2. Están presentes en cualquier posición en las moléculas de RNA.
3. Se localizan en cualquier posición en la secuencia primaria de la proteína.
4. Son esenciales para la función de la clatrina.

Respuesta correcta: 3. Se localizan en cualquier posición en la secuencia primaria de la proteína.